laparoscopic bowel or solid organ resection except laparoscopic cholecystectomy

The above is a clinical trial exclusion criterion. Annotated with entity spans:
[Procedure: laparoscopic bowel] or [Procedure: solid organ resection] [Negation: except] [Procedure: laparoscopic cholecystectomy]